¿A qué tipo de patología corresponde la enfermedad granulomatosa crónica.
1. Agammaglobulinemia congénita.
2. Déficit de células T.
3. Inmunodeficiencia severa combinada.
4. Déficit en la capacidad microbicida de los fagocitos.
5. Neutropenia congénita.

Respuesta correcta: 4. Déficit en la capacidad microbicida de los fagocitos.